Clinical trial exclusion criterion:
Psychosis

Annotated entities:
- Condition: "Psychosis"